What disease does BCG immunotherapy used to treat?

BCG immunotherapy is the choice of care for high-grade non-muscle invasive bladder cancer (NMIBC) after transurethral resection.